existing neurological deficit in the area to be blocked;

The above is a clinical trial exclusion criterion. Annotated with entity spans:
[Temporal: existing] [Condition: neurological deficit] in the [Qualifier: area to be blocked];